What is YESCARTA?

Yescarta is an autologous chimeric antigen receptor (CAR) T cell therapy approved by the FDA. Yescarta™ is approved for the treatment of adult patients with R/R large B cell lymphoma. It is a CD19-specific CAR T cell therapy lysing CD19-positive targets.